En un test de hipótesis se denomina error beta a la probabilidad de:
1. Aceptar una hipótesis nula siendo cierta.
2. Rechazar una hipótesis nula siendo falsa.
3. Aceptar una hipótesis alternativa siendo cierta.
4. Rechazar una hipótesis alternativa siendo falsa.
5. Aceptar una hipótesis nula siendo falsa.

Respuesta correcta: 5. Aceptar una hipótesis nula siendo falsa.